Population Index related topics :

The above is a clinical trial inclusion criterion. Annotated with entity spans:
[Parsing_Error: Population Index related topics :]